Patients with previous periorbital/forehead surgery

The above is a clinical trial exclusion criterion. Annotated with entity spans:
Patients with previous [Procedure: periorbital]/[Procedure: forehead surgery]